What is the role of SDE2?

Silencing Defective 2 (SDE2) is an essential gene required for ribosome biogenesis and the regulation of alternative splicing. SDE2 depletion leads to widespread changes in alternative splicing, defects in ribosome biogenesis and ultimately complete loss of cell viability.